Patient or next of kin does not consent with study participation

The above is a clinical trial exclusion criterion. Annotated with entity spans:
[Informed_consent: Patient or next of kin does not consent with study participation]